Clinical trial exclusion criterion:
Diagnosis of other active, ongoing skin diseases or skin infections that may interfere with examination of psoriasis lesions

Entity relations:
- Has_temporal("skin diseases", "ongoing")
- Has_qualifier("skin diseases", "active")
- OR("skin diseases", "skin infections")